Clinical trial inclusion criterion:
Patient fasting for at least 6 hours.

Entity relations:
- Has_temporal("fasting", "for at least 6 hours.")